Clinical trial exclusion criterion:
2 target lesions in the same coronary territory

Annotated entities:
- Multiplier: "2"
- Condition: "target lesions"
- Qualifier: "in the same coronary territory"